Un paciente que refiere dolor torácico y cervicobraquial. A la exploración física se advierte miosis y enoftalmos unilateral. En la radiografía de tórax se observa opacidad en vértice y erosión de las primeras costillas. ¿Cuál es su diagnóstico?
1. Tumor de Pancoast.
2. Tumor de mediastino.
3. Mesotelioma pleural localizado.
4. Tumor bronquioloalveolar.
5. Cáncer microcítico de pulmón con metástasis cerebrales.

Respuesta correcta: 1. Tumor de Pancoast.